Clinical trial exclusion criterion:
Has had major surgery to liver or other site within 4 weeks prior to the first dose of study medication

Entity relations:
- Has_qualifier("major surgery", "liver")
- Has_index("within 4 weeks prior", "first dose of study medication")
- Has_temporal("major surgery", "within 4 weeks prior")
- OR("liver", "other site")